一位在噴砂工作超過 20 年的男性，若工作時未作適當的防護，他對以下那一項疾病，比一般人有較高的罹患率？
A. 職業氣喘症
B. 肺結核
C. 肺炎
D. 膀胱癌

正確答案：B. 肺結核